Clinical trial exclusion criterion:
Cardiac arrhythmias (2nd and 3rd degree heart block or premature ventricular complexes in Lown classes 4 or 5)

Annotated entities:
- Condition: "Cardiac arrhythmia"
- Condition: "3rd degree heart block"
- Condition: "2nd degree heart block"
- Condition: "premature ventricular complexes"
- Qualifier: "Lown classes 4"
- Qualifier: "Lown classes 5"